Explain the use of Radio Frequency Ablation as a treatment

Radio frequency ablation is used in the treatment of infertility.